Palpable fibroids or uterine prolapse: Grade 2 or 3.

The above is a clinical trial exclusion criterion. Annotated with entity spans:
[Condition: Palpable fibroids] or [Condition: uterine prolapse]: [Measurement: Grade] [Value: 2 or 3].